Los cuerpos de Negri son masas de partículas víricas visibles al microscopio óptico en las células infectadas por el virus de:
1. La viruela.
2. La rabia.
3. El polioma.
4. La fiebre amarilla.
5. El herpes.

Respuesta correcta: 2. La rabia.